有關隱睪症（cryptorchidism）的敘述，下列何者錯誤？
A. 可能合併腹股溝疝氣
B. 手術以睪丸固定術（orchidopexy）為主
C. 未經治療的隱睪症病患日後有可能造成不孕
D. 手術的時機為學齡後

正確答案：D. 手術的時機為學齡後